Clinical trial exclusion criterion:
The patients have bilateral breast cancers or DCIS or metastatic breast cancers.

Entity relations:
- OR("bilateral breast cancers", "DCIS", "metastatic breast cancers")